Liver Transplant Recipients have received liver transplantations for at least 6+1 months prior to enrollment

The above is a clinical trial inclusion criterion. Annotated with entity spans:
[Person: Liver Transplant Recipients] have received [Procedure: liver transplantations] [Temporal: for at least 6+1 months prior to enrollment]